Clinical trial exclusion criterion:
Active ischemia (acute thrombus diagnosed by coronary angiography, or dynamic ST segment changes demonstrated on ECG) or another reversible cause of VT (e.g. drug-induced arrhythmia), had recent acute coronary syndrome within 30 days, coronary revascularization (<90 days bypass surgery, <30 days percutaneous coronary intervention), or have CCS functional class IV angina. Note that biomarker level elevation alone after ventricular arrhythmias does not denote acute coronary syndrome or active ischemia.

Annotated entities:
- Condition: "ischemia"
- Qualifier: "Active"
- Condition: "acute thrombus"
- Procedure: "coronary angiography"
- Condition: "ST segment changes"
- Procedure: "ECG"
- Condition: "VT"
- Qualifier: "reversible"
- Condition: "drug-induced arrhythmia"
- Condition: "acute coronary syndrome"
- Temporal: "within 30 days,"
- Procedure: "coronary revascularization"
- Temporal: "<90 days"
- Procedure: "bypass surgery"
- Temporal: "<30 days"
- Procedure: "percutaneous coronary intervention"
- Condition: "angina"
- Measurement: "CCS functional class"
- Value: "IV"
- Non-query-able: "Note that biomarker level elevation alone after ventricular arrhythmias does not denote acute coronary syndrome or active ischemia"